Clinical trial exclusion criterion:
Patients who are on anticoagulation medication that may not be safely held for the procedure (≥ 5 days for antiplatelet agents and warfarin; ≥ 24 hours for low-molecular weight heparin formulations) will be excluded.

Annotated entities:
- Drug: "anticoagulation medication"
- Undefined_semantics: "anticoagulation medication"
- Qualifier: "may not be safely held for the procedure"
- Subjective_judgement: "may not be safely held for the procedure"
- Multiplier: "≥ 5 days"
- Drug: "antiplatelet agents"
- Drug: "warfarin"
- Multiplier: "≥ 24 hours"
- Drug: "low-molecular weight heparin"